Clinical trial exclusion criterion:
Can not obtain the child's parental consent

Entity relations:
- Has_negation("child's parental consent", "not")